¿Cómo se denomina el procedimiento del condicionamiento clásico en el que el estímulo incondicionado se presenta y finaliza antes de que se presente el estímulo condicionado?:
1. De demora corta.
2. De demora larga.
3. De huella.
4. Hacia atrás.

Respuesta correcta: 4. Hacia atrás.